imaging findings of degenerative changes of the joint (osteoarthritis or chondropathy with Kellgren Lawrence Score from 0 to 3 at X-ray evaluation).

The above is a clinical trial inclusion criterion. Annotated with entity spans:
[Procedure: imaging] findings of [Condition: degenerative changes] of the joint ([Condition: osteoarthritis] or [Condition: chondropathy] with [Measurement: Kellgren Lawrence Score] [Value: from 0 to 3] at [Procedure: X-ray] evaluation).